Tubal disease.

The above is a clinical trial exclusion criterion. Annotated with entity spans:
[Condition: Tubal disease].